Clinical trial inclusion criterion:
Good general health ascertained by medical history, physical examination and laboratory determinations, showing no signs of clinically significant findings, except chronic atopic dermatitis

Annotated entities:
- Condition: "Good general health"
- Temporal: "medical history"
- Procedure: "physical examination"
- Procedure: "laboratory determinations"
- Negation: "no"
- Observation: "signs of clinically significant findings"
- Qualifier: "clinically significant"
- Subjective_judgement: "clinically significant"
- Condition: "chronic atopic dermatitis"
- Negation: "except"
- Qualifier: "ascertained by medical history, physical examination and laboratory determinations"